從一泌尿道感染病人的檢體中，分離到一抗耐啶酸（Nalidixic acid）的細菌，此菌產生抗藥最主要的原因為何？
A. 細胞壁結構組成改變
B. DNA gyrase 結構發生改變
C. 50S 核糖體結構改變
D. 30S 核糖體結構改變

正確答案：B. DNA gyrase 結構發生改變